Clinical trial inclusion criterion:
body mass index less than 30 kg/m2

Annotated entities:
- Measurement: "body mass index"
- Value: "less than 30 kg/m2"